下列有關貝歇氏症（Behçet's disease）的敘述，何者錯誤？
A. 25-30%會侵犯到中樞神經系統
B. 眼睛經常受到侵犯，甚至可能導致失明
C. 常見顱神經病變
D. 老年女性較易罹患

正確答案：D. 老年女性較易罹患